Clinical trial exclusion criterion:
Has been previously treated with sugammadex or has participated in a sugammadex clinical trial.

Entity relations:
- AND("participated in clinical trial", "sugammadex")
- Has_temporal("sugammadex", "previously")
- OR("sugammadex", "participated in clinical trial")